Clinical trial inclusion criterion:
Sedentary lifestyle, defined as <150 min/wk of moderate physical activity as assessed by CHAMPS questionnaire

Entity relations:
- Has_value("moderate physical activity", "<150 min/wk")
- AND("moderate physical activity", "CHAMPS questionnaire")
- OR("Sedentary lifestyle", "moderate physical activity")